一位 15 歲男性病人，被家裏所養的貓抓了以後，局部淋巴結腫大，診斷為 cat-scratch disease，下列有關此病之敘述，何者錯誤？
A. 此病是 Bartonella quintana 所引起的
B. 此病通常發生在小孩身上
C. 此病淋巴結的病理特徵是 granulomatous inflammation with stellate necrosis
D. 此病通常不用抗生素治療也會自行痊癒（self-limited）

正確答案：A. 此病是 Bartonella quintana 所引起的